¿Cuál de los siguientes componentes NO forma parte del modelo actitudinal de la Teoría de la Conducta de Fishdein y Ajzen?:
1. Norma subjetiva.
2. Control conductual percibido.
3. Intención.
4. Auto-percepción.

Respuesta correcta: 4. Auto-percepción.